一位懷孕週數 39 週，出生體重 3200 gm 的自然產新生兒，出生 24 小時後出現發紺（cyanosis）、呼吸窘迫（respiratory distress）及腹部凹下（scaphoid abdomen）的現象。下列何者為最可能之診斷？
A. 後鼻孔閉鎖
B. 先天性橫膈膜疝氣
C. 新生兒一過性呼吸急促
D. 新生兒呼吸窘迫症候群

正確答案：B. 先天性橫膈膜疝氣